Clinical trial exclusion criterion:
Known lymphomatous involvement of the CNS.

Annotated entities:
- Condition: "lymphomatous involvement of the CNS"
- Undefined_semantics: "lymphomatous involvement of the CNS"